Drugs related to acetylcholine metabolism

The above is a clinical trial exclusion criterion. Annotated with entity spans:
[Drug: Drugs] [Qualifier: related to acetylcholine metabolis]m